Clinical trial inclusion criterion:
Stable prednisone <10mg or equivalent

Annotated entities:
- Multiplier: "Stable"
- Drug: "prednisone"
- Value: "<10mg"